Clinical trial inclusion criterion:
healthy

Annotated entities:
- Condition: "healthy"